Clinical trial inclusion criterion:
A positive scrub typhus RDT (Scrub Typhus IgM RDT, InBios International, Seattle, WA, USA) and/or positive PCR-based detection of O. tsutsugamushi DNA from the admission blood sample

Entity relations:
- Has_value("scrub typhus RDT", "positive")
- Subsumes("scrub typhus RDT", "Scrub Typhus IgM RDT")
- Has_qualifier("PCR", "O. tsutsugamushi DNA")
- Has_qualifier("PCR", "admission blood sample")
- Has_value("PCR", "positive")
- OR("scrub typhus RDT", "PCR")